For CTCL: (TSEBT) within 12 weeks, or initiation of topical steroid, nitrogen mustard, or topical retinoid within 2 weeks. (Stable topical ≥ 4 weeks prior to Day 1 allowed).

The above is a clinical trial exclusion criterion. Annotated with entity spans:
For [Condition: CTCL]: ([Procedure: TSEBT]) [Temporal: within 12 weeks], or [Observation: initiation] of [Drug: topical steroid], [Drug: nitrogen mustard], or [Drug: topical retinoid] [Temporal: within 2 weeks]. (Stable topical [Temporal: ≥ 4 weeks prior to Day 1] [Grammar_Error: allowed]).